下列對於癲癇診斷分類何者正確？
A. 失神性發作（absence seizures）常常會有先兆（aura），並且時間常常超過5分鐘以上
B. 肌攣性發作（myoclonic seizures）以快速而短暫的肌肉收縮與躍動為主要表現
C. 肌攣性發作（myoclonic seizures）主要影響四肢（limbs），並不會影響軀幹（trunk）
D. 失張力性發作（atonic seizures）往往在強直-陣攣性發作（tonic-clonic seizure）後發生

正確答案：B. 肌攣性發作（myoclonic seizures）以快速而短暫的肌肉收縮與躍動為主要表現